Body mass index > 30Kg/m2 or > 27.5 Kg/m2 (South Asian),

The above is a clinical trial inclusion criterion. Annotated with entity spans:
[Measurement: Body mass index] [Value: > 30Kg/m2] or [Value: > 27.5 Kg/m2] (South Asian),